Clinical trial exclusion criterion:
Unable to take oral medications

Entity relations:
- AND("oral medications", "Unable to take")